主動脈瓣閉鎖不全的病人，雖然臨床上並沒有心臟衰竭的症候，但若下列何現象出現，表示左心室功能開始在變差，應儘速手術治療？
A. 左心室心縮末期寬度（LVESD）大於 50 毫米
B. 左心室心舒末期寬度（LVEDD）大於 50 毫米
C. 左心房最大寬度大於 50 毫米
D. 主動脈瓣環部最大寬度大於 30 毫米

正確答案：A. 左心室心縮末期寬度（LVESD）大於 50 毫米